Known proved BKV nephropathy

The above is a clinical trial exclusion criterion. Annotated with entity spans:
Known [Qualifier: proved] [Condition: BKV nephropathy]